Patients with intercurrent infections.

The above is a clinical trial exclusion criterion. Annotated with entity spans:
Patients with [Condition: intercurrent infections].